Clinical trial exclusion criterion:
Known renovascular hypertension or evidence of pulmonary hypertension (pulmonary vascular resistance > 6 Wood units) unresponsive to vasodilator agents such as oxygen, nitroprusside, or nitric oxide

Entity relations:
- Has_mood("pulmonary hypertension", "evidence of")
- Has_value("pulmonary vascular resistance", "> 6 Wood units")
- Subsumes("pulmonary hypertension", "pulmonary vascular resistance")
- multi("unresponsive to vasodilator agents", "vasodilator agents")
- Subsumes("vasodilator agents", "oxygen")
- Has_qualifier("renovascular hypertension", "unresponsive to vasodilator agents")
- OR("renovascular hypertension", "pulmonary hypertension")
- OR("oxygen", "nitric oxide", "nitroprusside")